Clinical trial exclusion criterion:
Diabetes mellitus or plasma glucose >11,1 at admission.

Entity relations:
- Has_value("plasma glucose", ">11,1")
- Has_temporal("plasma glucose", "at admission")
- OR("Diabetes mellitus", "plasma glucose")